Chronic obstructive pulmonary disease;

The above is a clinical trial exclusion criterion. Annotated with entity spans:
[Condition: Chronic obstructive pulmonary disease];